Clinical trial inclusion criterion:
Patients with acute throat diseases: pharyngitis, tonsillitis, pharyngotonsillitis

Annotated entities:
- Condition: "acute throat diseases"
- Undefined_semantics: "acute throat diseases"
- Condition: "pharyngitis"
- Condition: "tonsillitis"
- Condition: "pharyngotonsillitis"